早期懷孕婦女的抹片檢查有惡性細胞，如果陰道鏡檢查及切片檢查無法確定子宮頸侵襲癌的存在，要施行診斷性圓錐形切片（conization）時，最好在何時？
A. 妊娠第Ⅰ期（first trimester）
B. 妊娠第Ⅱ期（second trimester）
C. 妊娠第Ⅲ期（third trimester）
D. 產後

正確答案：B. 妊娠第Ⅱ期（second trimester）